Clinical trial inclusion criteria:
Patients with pulmonary arterial hypertension (PAH)
Patients with chronic thromboembolic pulmonary hypertension (CTEPH)
All prevalent patients (diagnosed >12 month ago) with PAH or distal CTEPH who had a consultation at the PH centre in Zurich between November 2015 and November 2016)

Annotated entities:
- Condition: "pulmonary arterial hypertension (PAH)"
- Condition: "chronic thromboembolic pulmonary hypertension (CTEPH)"
- Temporal: ">12 month ago"
- Condition: "PAH"
- Condition: "CTEPH"
- Qualifier: "distal"
- Non-query-able: "consultation at the PH centre"
- Visit: "Zurich"
- Temporal: "between November 2015 and November 2016"
- Visit: "consultation at the PH centre"
- Context_Error: "prevalent"